Clinical trial inclusion criterion:
6. No Congenital,Mental and other Nervous system diseases

Entity relations:
- Has_negation("Congenital diseases", "No")
- Has_negation("Mental disease", "No")